Clinical trial exclusion criterion:
Receiving any neoadjuvant therapy,

Annotated entities:
- Procedure: "neoadjuvant therapy"